Clinical trial inclusion criterion:
Baseline 6-minutes walking distance 150m-550m.

Entity relations:
- Has_value("6-minutes walking distance", "150m-550m")
- Has_temporal("6-minutes walking distance", "Baseline")